Clinical trial inclusion criterion:
Stated willingness to comply with all study procedures and availability for the duration of the study

Annotated entities:
- Post-eligibility: "Stated willingness to comply with all study procedures and availability for the duration of the study"